Total ankylosis of the spine

The above is a clinical trial inclusion criterion. Annotated with entity spans:
[Condition: Total ankylosis of the spine]